Clinical trial exclusion criterion:
Person has a history of chronic skin breakdown on the residual limb.

Annotated entities:
- Condition: "skin breakdown"
- Qualifier: "chronic"
- Qualifier: "residual limb"